List available genetic multicolor cell labeling techiniques in Drosophila

Flybow and Drosophila Brainbow.